Clinical trial exclusion criterion:
Non-English speaking parents/patients.

Annotated entities:
- Observation: "Non-English speaking parents"
- Observation: "Non-English speaking patients"